Clinical trial inclusion criterion:
ANC = 1.5 × 109 / L

Entity relations:
- Has_value("ANC", "= 1.5 × 109 / L")